Clinical trial inclusion criterion:
BMI = 40 kg/m2.

Annotated entities:
- Measurement: "BMI"
- Value: "= 40 kg/m2"